Clinical trial exclusion criterion:
Cardiac arrhythmia

Annotated entities:
- Condition: "Cardiac arrhythmia"